一位68歲女性，因為倦怠無力而來門診求醫。理學檢查除了臉色特別紅潤，脾臟有腫大的現象。此外，並無 其他異常。血液數據顯示：白血球12,200/µL，分類segmented neutrophil 79.7%，lymphocyte 12,7%，無不成熟細胞。血紅素20.3 g/dL，Hematocrit 61.5%，MCV（mean cell volume）89.2 fL，MCHC（mean cell hemoglobin concentration）33.8 g/dL，血小板446,000/µL，尿酸7.6 mg/dL（參考區間2.6～7.5）。骨髓檢查結果呈現hypercellularity，而且紅血球系列、白血球系列與巨核細胞（megakaryocyte）均有明顯增生的現象。JAK2 gene有V617F的突變。以下關於這位病人最可能的疾病之診斷與治療，何者錯誤？
A. Interferon可以縮小脾臟，降低各種血球數目，也可以減少突變基因JAK2 V617F之allelic burden
B. 對於紅血球過多所引起之hyperviscosity，第一線的解決方法是phlebotomy
C. 這種病人的plasma volume也是增加的，因此有些這樣的病人其hematocrit反而不會明顯增加
D. 這種病人的serum erythropoietin levels通常是升高的

正確答案：D. 這種病人的serum erythropoietin levels通常是升高的